Clinical trial exclusion criterion:
Pregnant or breast feeding

Annotated entities:
- Pregnancy_considerations: "Pregnant or breast feeding"